Clinical trial inclusion criterion:
Prior hormonal therapy is allowed as:

Annotated entities:
- Temporal: "Prior"
- Procedure: "hormonal therapy"
- Mood: "is allowed"